Clinical trial exclusion criterion:
significant valvular disease,

Entity relations:
- Has_qualifier("valvular disease", "significant")